Clinical trial inclusion criteria:
Parkinson disease diagnosed by United Kingdom Parkinson's disease Society Brain Bank Criteria
Postural instability and gait disturbance phenotype
Hoehn and Yahr stage = 3
Mini-Mental status examination = 24

Annotated entities:
- Condition: "Parkinson disease"
- Measurement: "United Kingdom Parkinson's disease Society Brain Bank Criteria"
- Condition: "Postural instability"
- Condition: "gait disturbance"
- Measurement: "Hoehn and Yahr"
- Value: "stage = 3"
- Measurement: "Mini-Mental status examination"
- Value: "= 2"